Mujer de 26 años sin antecedentes psiquiátricos previos, acude a Urgencias traída por sus padres que explican que desde hace unos días está hiperactiva, nerviosa, insomne. Explican que revisa obsesivamente la instalación eléctrica de casa en busca de cámaras de video y micrófonos. En la entrevista nos dice que le están vigilando desde la Policía pues ella es una enviada galáctica con poderes especiales. ¿Cuál de las siguientes opciones NO debe considerarse como diagnóstico diferencial?
1. Trastorno obsesivo compulsivo.
2. Esquizofrenia.
3. Episodio maniaco.
4. Psicosis por consumo de sustancias tóxicas.
5. Tumor cerebral.

Respuesta correcta: 1. Trastorno obsesivo compulsivo.